How many copies of LBX are found in teleosts?

URL_0   > In teleosts, that have undergone an additional genome duplication, 8 LBx paralogons (three of which retain Lbx genes) were found.